某病人已被診斷為第一型神經纖維瘤（NF-1），其一等親家屬被診斷為相同疾病之另一要件，不包括下列何者？
A. 成人皮膚出現 6 個以上（每個大於 15 毫米）之咖啡斑（café-au-lait spots）
B. 兩側聽神經瘤（acoustic neuroma）
C. 身上有 2 個以上神經纖維瘤（neurofibroma）
D. 視神經膠質細胞瘤（optic glioma）

正確答案：B. 兩側聽神經瘤（acoustic neuroma）